Clinical trial inclusion criterion:
Age= 18 years and less than 70 years.

Entity relations:
- Has_value("Age", "= 18 years and less than 70 years")